一位 32 歲女性病人懷孕 3 個月，血壓介於 156/96 至 170/105 mmHg 之間，下列何種降血壓藥為絕對禁忌（absolute contraindication）？
A. Angiotensin converting enzyme inhibitor（ACEI）
B. Hydralazine
C. Methyldopa
D. 鈣離子阻斷劑（Calcium antagonist）

正確答案：A. Angiotensin converting enzyme inhibitor（ACEI）